Severe infectious disease, example (eg) Human Immunodeficiency Virus positive or active tuberculosis.

The above is a clinical trial exclusion criterion. Annotated with entity spans:
[Qualifier: Severe] [Condition: infectious disease], example (eg) [Condition: Human Immunodeficiency Virus positive] or [Qualifier: active] [Condition: tuberculosis].